Clinical trial inclusion criterion:
Thoracoscopic surgery candidate.

Annotated entities:
- Procedure: "Thoracoscopic surgery"
- Mood: "candidate"